Clinical trial inclusion criterion:
4. On a stable and recommended dose of UDCA for the past twelve months

Entity relations:
- Has_temporal("UDCA", "for the past twelve months")
- Has_qualifier("UDCA", "stable dose")
- Has_qualifier("UDCA", "recommended dose")